Clinical trial inclusion criterion:
Adult patients up to age 75 years, undergoing elective, ambulatory, arthroscopic rotator cuff repair.

Entity relations:
- AND("arthroscopic rotator cuff repair", "ambulatory")
- Has_qualifier("arthroscopic rotator cuff repair", "elective")
- Has_value("age", "up to 75 years")